骨骼肌在鬆弛過程中的作用，主要是藉下列何者將鈣離子送回肌漿網（Sarcoplasmic reticulum）？
A. Calsequestrin
B. Triadin
C. Calcium ion-ATPase
D. Calcineurin

正確答案：C. Calcium ion-ATPase